當一位 30 歲男性呼吸一般室內空氣時，其動脈血液氣體分析是PaO2 60 mmHg，PaCO2 48 mmHg，則其AaDO2（肺泡動脈血液氧氣分壓差）是多少？
A. 0 mmHg
B. 10 mmHg
C. 20 mmHg
D. 30 mmHg

正確答案：D. 30 mmHg